Which algorithms are used for compression of SAM files?

The most popular format for genomic data is the SAM (Sequence Alignment/Map) format, which contains information such as alignment, quality values, etc. These files are large (on the order of terabytes), which necessitates compression. GeneComp, NGC, SAMZIP and QVZ are algorithms which perform compression of data stored in SAM files.